12. Chronic heart failure complicated with acute hemodynamic disturbance or acute decompensation within last 1 month;

The above is a clinical trial exclusion criterion. Annotated with entity spans:
12. [Condition: Chronic heart failure] complicated with [Condition: acute hemodynamic disturbance] or [Condition: acute decompensation] [Temporal: within last 1 month];